Life expectancy under 6 months

The above is a clinical trial exclusion criterion. Annotated with entity spans:
[Observation: Life expectancy] [Value: under 6 months]